Clinical trial inclusion criterion:
Constant habitual diet patterns within last 3 months

Annotated entities:
- Condition: "Constant habitual diet patterns"
- Temporal: "within last 3 months"